Patients who have experienced in-hospital CA;

The above is a clinical trial exclusion criterion. Annotated with entity spans:
Patients who have experienced [Qualifier: in-hospital] [Condition: CA];